ADHD

The above is a clinical trial inclusion criterion. Annotated with entity spans:
[Condition: ADHD]